Columbia-Suicide Severity Rating Scale (C-SSRS) for suicidal ideation and behavior in past year.

The above is a clinical trial exclusion criterion. Annotated with entity spans:
[Measurement: Columbia-Suicide Severity Rating Scale] ([Measurement: C-SSRS]) for [Condition: suicidal ideation] and behavior [Temporal: in past year].